Clinical trial exclusion criterion:
Previous treated with anti-diabetic medication

Annotated entities:
- Drug: "anti-diabetic medication"
- Temporal: "Previous"
- Procedure: "treated"